Clinical trial exclusion criterion:
Is pregnant or breast feeding or expecting to conceive or father starting from the first dose of study medication, throughout the study period, and for up to 120 days after the last dose of study medication

Annotated entities:
- Condition: "pregnant"
- Observation: "breast feeding"
- Observation: "expecting to conceive"
- Observation: "expecting to father"
- Temporal: "starting from the first dose of study medication"
- Reference_point: "the first dose of study medication"
- Temporal: "throughout the study period"
- Reference_point: "the study period"
- Temporal: "for up to 120 days after the last dose of study medication"
- Reference_point: "the last dose of study medication"